關於傷口癒合之膠原蛋白（collagen）的合成，下列敘述何者錯誤？
A. 受傷後，纖維母細胞開始合成第三型膠原蛋白（type III collagen）
B. 膠原蛋白是傷口癒合之主要成分
C. 膠原蛋白之合成，始於膠原蛋白前身（procollagen）之α鏈（pro-α-chains）黏著在高爾基氏體
D. 第一型膠原蛋白（type I collagen）占成人皮膚的 80%

正確答案：C. 膠原蛋白之合成，始於膠原蛋白前身（procollagen）之α鏈（pro-α-chains）黏著在高爾基氏體